patients with unilateral or bilateral nephrectomy

The above is a clinical trial exclusion criterion. Annotated with entity spans:
patients with [Qualifier: unilateral] or [Qualifier: bilateral] [Procedure: nephrectomy]